Patients experiencing cardiogenic shock

The above is a clinical trial exclusion criterion. Annotated with entity spans:
Patients experiencing [Condition: cardiogenic shock]